Clinical trial exclusion criterion:
Intolerance of pulsed corticosteroids, especially a history of steroid psychosis

Entity relations:
- Has_temporal("steroid psychosis", "history of")
- AND("Intolerance", "pulsed corticosteroids")
- OR("Intolerance", "steroid psychosis")